Clinical trial inclusion criterion:
Immunosuppression with tacrolimus and/or mycophenolate (Prednisone use is allowed at low dose, ≤10 mg/d).

Annotated entities:
- Procedure: "Immunosuppression"
- Drug: "tacrolimus"
- Drug: "mycophenolate"
- Drug: "Prednisone"
- Multiplier: "low dose"
- Value: "≤10 mg/d"